鐮狀紅血球性貧血（sickle cell anemia）是血紅素（hemoglobin）的突變，這突變是發生在β-鏈核酸的：
A. 刪除
B. 插入
C. 甲基化
D. 點突變

正確答案：D. 點突變